有關人類肝臟細胞的葡萄糖生成作用（gluconeogenesis），下列敘述何者正確？
A. 完全由醣解作用（glycolysis）的酵素所催化的逆反應來執行
B. 可幫助在高糖飲食之後使血糖值下降
C. 對於脂肪酸轉變成為葡萄糖為必須的
D. 可利用一些胺基酸將其轉變成為葡萄糖

正確答案：D. 可利用一些胺基酸將其轉變成為葡萄糖